Clinical trial inclusion criteria:
3 -15 years old
Clinical symptoms suggestive of pharyngitis with MC Isaac score =3
Rapid-antigen detection test (RADT) positive for GAS-
Signed informed parental/patient consent form

Annotated entities:
- Value: "3 -15 years"
- Person: "old"
- Condition: "pharyngitis"
- Mood: "Clinical symptoms suggestive of"
- Measurement: "MC Isaac score"
- Value: "=3"
- Measurement: "RADT"
- Measurement: "Rapid-antigen detection test"
- Value: "positive"
- Qualifier: "GAS-"
- Informed_consent: "Signed informed parental/patient consent form"